Clinical trial exclusion criterion:
Severe malnutrition

Entity relations:
- Has_qualifier("malnutrition", "Severe")